Clinical trial inclusion criterion:
8. Have a calculated creatinine clearance of >/= 60 cc/min.

Annotated entities:
- Measurement: "calculated creatinine clearance"
- Value: ">/= 60 cc/min"